Clinical trial exclusion criterion:
Current significant medical problems that, in the discretion of the investigator, would put the patient at significant risk

Annotated entities:
- Non-query-able: "Current significant medical problems that, in the discretion of the investigator, would put the patient at significant risk"